Clinical trial exclusion criterion:
Patients with a history of an untreated malignancy (except local skin cancers)

Annotated entities:
- Qualifier: "untreated"
- Condition: "malignancy"
- Condition: "local skin cancers"
- Negation: "except"